Clinical trial exclusion criterion:
Patients with important organ dysfunctions.

Annotated entities:
- Condition: "organ dysfunctions"
- Qualifier: "important"